5 歲男童患有腎病症候群（nephrotic syndrome），病理切片在光學顯微鏡下可見到少數腎絲球有局部絲球硬化，螢光染色見到 IgM 及 C3 補體的沈澱，電子顯微鏡見到足狀突出融合（foot process fusion）。下列有關其臨床之描述何者正確？
A. 臨床上常合併有血尿
B. 百分之五十以上對類固醇治療有效
C. 臨床上預後良好，大多可在一年內達到緩解
D. 實驗室檢查常可見到補體（C3，C4）下降

正確答案：A. 臨床上常合併有血尿